Clinical trial inclusion criterion:
Likely suffer moderate-to-severe OSA based on history and physical or have an established diagnosis of OSA (20=AHI=65) based on a prior in-lab Polysomnography

Entity relations:
- Has_qualifier("OSA", "moderate")
- Has_value("AHI", "20 =65")
- AND("OSA", "AHI")
- OR("moderate", "severe")
- OR("OSA", "OSA")